一位 45 歲的女病人，因子宮肌瘤和第 II 期卵巢癌，進行子宮及雙側輸卵管、卵巢切除後，第 5 天發現左側小腿腫脹，經診斷為深部靜脈血栓症（deep-vein thrombosis）。下列何種療法對病人最好？
A. 經靜脈給予 streptokinase 72 小時後，再給予 coumadin 3 個月
B. 經靜脈給予 streptokinase 24 小時後，再給予 coumadin 3 個月
C. 經靜脈給予 heparin 5 天後，再給予 coumadin 3 個月
D. 臥床抬高左腿後，立即給予 coumadin 3 個月

正確答案：C. 經靜脈給予 heparin 5 天後，再給予 coumadin 3 個月